Clinical trial exclusion criterion:
1. A medical condition, other than PBC, that in the investigator's opinion would preclude full participation in the study or confound its results (e.g., cancer on active treatment)

Annotated entities:
- Parsing_Error: "1."
- Condition: "medical condition"
- Condition: "PBC"
- Negation: "other than"
- Subjective_judgement: "in the investigator's opinion"
- Non-query-able: "A medical condition, other than PBC, that in the investigator's opinion would preclude full participation in the study or confound its results (e.g., cancer on active treatment)"
- Post-eligibility: "A medical condition, other than PBC, that in the investigator's opinion would preclude full participation in the study or confound its results (e.g., cancer on active treatment)"